Clinical trial exclusion criterion:
Patients will be excluded if they could not tolerate MET during the recommended titration schedule outlined in the protocol;

Entity relations:
- AND("not tolerate", "MET")